Clinical trial exclusion criterion:
Vitamin B12 and/or serum folate deficiency according to the laboratory (re-screening is possible after substitution therapy).

Annotated entities:
- Condition: "Vitamin B12 deficiency"
- Condition: "serum folate deficiency"